Clinical trial exclusion criterion:
Serum creatinine level > 2.0 mg/dL

Annotated entities:
- Measurement: "Serum creatinine level"
- Value: "> 2.0 mg/dL"